Clinical trial exclusion criterion:
AUDIT score of < 5 or > 26

Entity relations:
- Has_value("AUDIT", "score of < 5 or > 26")